Clinical trial exclusion criterion:
Has used e-cigarettes and marijuana <1 years

Entity relations:
- Has_temporal("used e-cigarettes", "<1 years")
- OR("used e-cigarettes", "used marijuana")